關於grade IV astrocytoma（glioblastoma）的敘述，何者錯誤？
A. 此疾病預後不佳，平均存活期小於2年
B. 首次治療以手術，接續併用化學治療（temozolomide）及放射治療為主要治療方式
C. O6-methylguanine-DNA methyltransferase（MGMT）有表現的腫瘤，對於temozolomide的治療較有療效
D. bevacizumab可用於復發後的病人，此藥物可以減少腫瘤周邊的水腫，也可延⻑progression-free survival

正確答案：C. O6-methylguanine-DNA methyltransferase（MGMT）有表現的腫瘤，對於temozolomide的治療較有療效